Clinical trial exclusion criterion:
1. Patients with C class by child-pugh score

Annotated entities:
- Measurement: "child-pugh score"
- Value: "C class"